Clinical trial exclusion criterion:
Fasting cholesterol > 1.6 upper limits of normal.

Entity relations:
- Has_value("Fasting cholesterol", "> 1.6 upper limits of normal")